Clinical trial inclusion criterion:
absence of abnormal findings on X-ray.

Entity relations:
- AND("X-ray", "abnormal findings")
- Has_negation("abnormal findings", "absence of")